上呼吸道腫瘤利用免疫組織化學染色，發現腫瘤細胞表現synaptophysin與chromogranin抗原時，下列何者為最可能的診斷？
A. 鼻咽上皮細胞癌
B. 嗅母神經胚細胞癌（olfactory neuroblastoma）
C. 喉頭上皮細胞癌
D. NUT中線癌（NUT midline carcinoma）

正確答案：B. 嗅母神經胚細胞癌（olfactory neuroblastoma）